Clinical trial exclusion criterion:
Hematochrit >36%

Entity relations:
- Has_value("Hematochrit", ">36%")